Clinical trial exclusion criterion:
Concomitant participation in other trial

Annotated entities:
- Competing_trial: "Concomitant participation in other trial"